下列何種疾病之病原體是經由鼠蚤所傳播？
A. 叢林斑疹傷寒（scrub typhus）
B. 落磯山斑疹熱（Rocky mountain spotted fever）
C. 地方性斑疹傷寒（endemic typhus）
D. 流行性斑疹傷寒（epidemic typhus）

正確答案：C. 地方性斑疹傷寒（endemic typhus）